Histology other than glandular neoplasia,

The above is a clinical trial exclusion criterion. Annotated with entity spans:
[Procedure: Histology] [Qualifier: other than] [Condition: glandular neoplasia],